Clinical trial exclusion criterion:
All patients who cannot participate in an outpatient physical therapy program for 3 days per week after surgery

Entity relations:
- Has_index("for 3 days per week after surgery", "surgery")
- AND("physical therapy", "outpatient")
- Has_negation("physical therapy", "cannot")
- Has_temporal("physical therapy", "for 3 days per week after surgery")